有關 succimer 之敘述中，下列何者正確？
A. 又名 DMPS（dimercaptopropanesulfornic acid）
B. 要以肌肉注射給藥
C. 可用於治療小孩之血中高鉛濃度
D. 會有高血壓之副作用

正確答案：C. 可用於治療小孩之血中高鉛濃度